Clinical trial exclusion criterion:
Current use of active topical medication in the planned investigational area for chronic atopic dermatitis within two weeks

Annotated entities:
- Condition: "chronic atopic dermatitis"
- Temporal: "within two weeks"
- Drug: "topical medication"
- Temporal: "active"